Clinical trial inclusion criterion:
Acute myocardial infarction < 12 h defined as:

Entity relations:
- Has_temporal("Acute myocardial infarction", "< 12 h")